Patients that are prisoners

The above is a clinical trial exclusion criterion. Annotated with entity spans:
Patients that are [Person: prisoners]